Patients diagnosed with acromegaly with GH-secreting pituitary adenoma on sellar MRI, meeting the biochemical criteria outlined above (refer to 1. Diagnosis of acromegaly) and with typical acromegalic features.

The above is a clinical trial inclusion criterion. Annotated with entity spans:
Patients diagnosed with [Condition: acromegaly] with [Condition: GH-secreting pituitary adenoma] on [Procedure: sellar MRI], meeting the [Qualifier: biochemical criteria outlined above] (refer to 1. Diagnosis of acromegaly) and with [Qualifier: typical] [Condition: acromegalic features].